What is the purpose of the 123 dihydrorhodamine assay?

Dihydrorhodamine assays measure oxidative bursts and are used to quantify cell activation via respiratory bursts. Nitroblue-tetrazolium dye reduction test and 123 dihydro-rhodamine assay by flow cytometry are the screening tests for Chronic Granulomatous Disease.